有關肝癌（hepatocellular carcinoma）之診斷的敘述，下列何者為是？
A. 所有疑似肝癌之病灶，皆須施行腫瘤切片檢查，才可確立診斷
B. 血清胎兒球蛋白如正常，即可排除肝癌之可能性
C. 如有兩種影像學檢查發現高血管密度之肝腫瘤，同時血清胎兒球蛋白升高，即可診斷為肝癌
D. 不正常的肝功能，是診斷肝癌的必要條件

正確答案：C. 如有兩種影像學檢查發現高血管密度之肝腫瘤，同時血清胎兒球蛋白升高，即可診斷為肝癌